Clinical trial inclusion criterion:
Patients must have received prior external beam radiation therapy to the region proposed for HDR brachytherapy treatment; evaluation of doses previously delivered to spinal cord/cauda equine, pelvis, and other critical structures (bowel, kidneys, rectum) will be taken into consideration.

Entity relations:
- Has_temporal("external beam radiation therapy", "prior")
- AND("to the region proposed for HDR brachytherapy treatment", "HDR brachytherapy")
- Has_qualifier("external beam radiation therapy", "to the region proposed for HDR brachytherapy treatment")